En una analizador de tiempo de vuelo en espectrometría de masas:
1. Los iones con valores bajos de m/z o más ligeros llegan más rápidamente al detector.
2. Los iones con valores altos de m/z o más pesados llegan más rápidamente al detector.
3. Los iones no llegan al detector.
4. Lo iones con relación m/z impar llegan más rápidamente al detector.
5. El tiempo de análisis que se requiere generalmente es de segundos.

Respuesta correcta: 1. Los iones con valores bajos de m/z o más ligeros llegan más rápidamente al detector.